Which is the database of molecular recognition features in membrane proteins?

mpMoRFsDB provides valuable information related to disorder-based protein-protein interactions in membrane proteins.